How does Hst5 (histatin 5) affect infections by Candida glabrata?

Human salivary histatins, including histatin 5 (Hst 5), are small cationic proteins that are the major source of fungicidal activity of saliva